Clinical trial exclusion criterion:
hypogonadotropic hypogonadism

Annotated entities:
- Condition: "hypogonadotropic hypogonadism"